Clinical trial inclusion criterion:
For patients of reproductive potential (males and females), use of reliable means for contraception (e.g., contraceptive pill, intrauterine device [IUD], physical barrier) throughout the trial and for 1 year following their final exposure to study treatment

Entity relations:
- Subsumes("contraception", "contraceptive pill")
- Has_temporal("contraception", "throughout the trial")
- Has_temporal("contraception", "for 1 year following their final exposure")
- AND("reproductive potential", "contraception")
- OR("contraceptive pill", "physical barrier", "intrauterine device [IUD]")